Clinical trial exclusion criterion:
Patients currently on chemotherapy or with other primary cancers requiring systemic or hepatic loco-regional treatment.

Entity relations:
- Has_qualifier("primary cancers", "other")
- AND("primary cancers", "systemic loco-regional treatment")
- Has_temporal("chemotherapy", "currently")
- OR("systemic loco-regional treatment", "hepatic loco-regional treatment")
- OR("chemotherapy", "primary cancers")